某男大學生正在談戀愛，突然身體不適出現嚴重之虛弱無力、疲勞、發燒、咽喉炎及腺體腫脹等症狀，經醫師診斷後給予氨比西林（Ampicillin）治療後出現紅疹，血液抹片檢查觀察到非典型淋巴細胞，且血清內測得嗜異性抗體（heterophile antibody）。下列有關該疾病之敘述何者正確？
A. 由 EB 病毒（Epstein-Barr virus）感染所引起的傳染性單核球增多症（infectious mononucleosis）
B. 由 HIV 病毒（Human immunodeficiency virus）感染所引起之免疫缺失症
C. 由巨細胞病毒（Cytomegalovirus）感染所引起之類單核球增多症（mononucleosis-like）
D. 由單純疱疹病毒（Herpes simplex virus）感染所引起之咽喉炎

正確答案：A. 由 EB 病毒（Epstein-Barr virus）感染所引起的傳染性單核球增多症（infectious mononucleosis）